一個 28 歲男性病患因急性腹部劇痛、腹脹及發高燒到急診，但並無嘔吐症狀，理學檢查腹部脹大、具壓痛及輕微之反彈性壓痛，白血球為 19,800/μL，腹部 X 光顯示其右側大腸及近側橫結腸脹大，充滿腸氣，最大腸徑為 9 公分。病人在過去並未接受過任何腹部手術，但最近兩年多以來常有腹瀉現象，偶爾帶血，半年前之大腸鏡檢查並未發現有癌瘤。此時最可能之診斷為：
A. 左側大腸癌阻塞
B. 缺血性大腸炎合併阻塞
C. 慢性潰瘍性結腸炎合併毒性巨結腸
D. 黏連性大腸阻塞

正確答案：C. 慢性潰瘍性結腸炎合併毒性巨結腸